Clinical trial exclusion criterion:
American Society of Anesthesiologists Physical Status IV or V

Entity relations:
- Has_value("American Society of Anesthesiologists Physical Status", "IV or V")